Las subunidades sigma de las RNA polimerasas:
1. Reconocen los promotores en el DNA.
2. Añaden la cola de poliA en el mRNA.
3. Forman parte de los espliceosomas.
4. Se unen a la proteína rho para terminar la trascripción.

Respuesta correcta: 1. Reconocen los promotores en el DNA.